Clinical trial exclusion criterion:
Medical or psychiatric conditions comprising informed consent.

Entity relations:
- OR("Medical conditions", "psychiatric conditions")